Which drug was tested in the TEMSO Trial for multiple sclerosis?

Teriflunomide was evaluated in the Teriflunomide Multiple Sclerosis Oral (TEMSO) trial.